¿Qué permite conseguir un refuerzo negativo?
1. Disminuir la conducta reforzada.
2. Eliminar la conducta reforzada.
3. Aumentar la conducta reforzada.
4. Extinguir la conducta reforzada.
5. No hace variar la conducta.

Respuesta correcta: 3. Aumentar la conducta reforzada.